Clinical trial exclusion criterion:
People with any open or bleeding wounds at any sensor plate contact surface location

Annotated entities:
- Condition: "bleeding wounds"
- Condition: "open wounds"
- Qualifier: "at any sensor plate contact surface location"